Clinically infected ulcer

The above is a clinical trial exclusion criterion. Annotated with entity spans:
Clinically [Condition: infected ulcer]